Clinical trial inclusion criterion:
Ulcer located on the legs or feet, stage III or IV (Wagner Classification System)

Entity relations:
- Has_value("stage", "III or IV")
- Has_qualifier("stage", "Wagner Classification System")
- Has_qualifier("Ulcer", "legs")
- OR("legs", "feet")
- OR("Ulcer", "stage")